No subjects will be excluded based on their race, religion, ethnicity, gender or HIV status.

The above is a clinical trial inclusion criterion. Annotated with entity spans:
[Non-representable: No subjects will be excluded based on their race, religion, ethnicity, gender or HIV status.]